Those residing in another country or planned absence for more than one month.

The above is a clinical trial exclusion criterion. Annotated with entity spans:
[Non-representable: Those residing in another country or planned absence for more than one month.]